For patients previously treated with alglucosidase alfa the patient has received alglucosidase alfa for at least 6 months.

The above is a clinical trial inclusion criterion. Annotated with entity spans:
[Non-representable: For patients previously treated with alglucosidase alfa] the patient has received [Drug: alglucosidase alfa] [Temporal: for at least 6 months].